Clinical trial exclusion criterion:
Patients with type I diabetes or poorly controlled type II diabetes (Hb1Ac>8.5).

Annotated entities:
- Condition: "type I diabetes"
- Condition: "type II diabetes"
- Qualifier: "poorly controlled"
- Measurement: "Hb1Ac"
- Value: ">8.5"